How many proteins have been queried for protein partners by the Drosophila protein interaction map (DPiM)?

Over 5,000 proteins have been queried for protein partners by the Drosophila protein interaction map (DPiM).